En un paciente con clínica de insuficiencia cardiaca que presenta una ascitis desproporcionadamente elevada en relación al edema periférico, la etiología más probable sería:
1. Una estenosis aórtica grave.
2. Una miocardiopatía dilatada con disfunción ventricular izquierda significativa.
3. Una hipertensión pulmonar primaria.
4. Una miocardiopatía hipertrófica obstructiva.
5. Una pericarditis constrictiva.

Respuesta correcta: 5. Una pericarditis constrictiva.